NSTE-ACS with cardiogenic shock warranting emergent salvage surgery within 12 hrs from hospital admission

The above is a clinical trial exclusion criterion. Annotated with entity spans:
[Condition: NSTE-ACS] with [Condition: cardiogenic shock] [Mood: warranting] emergent [Procedure: salvage surgery] [Temporal: within 12 hrs from hospital admission]